70 歲男性，患糖尿病，因最近兩天意識逐漸不清而送醫。身體檢查顯示病人除意識不清外，口溫 39.6℃，血壓 90/50 mmHg，脈搏 120/min，呼吸次數 28/min，全身冒汗，右肺底部有明顯囉音，心臟無奔馬律亦無雜音，下肢較冰冷但無水腫。血液生化檢查顯示血糖 230 mg/dL，白血球 18,000/μL 。轉入加護病房後，中心靜脈壓（CVP）為 11 cm，心搏出指數（cardiac index）為 4.8 L/min/m2。本病人之休克最可能屬於下列那一種？
A. 低容性休克（hypovolemic shock）
B. 心因性休克（cardiogenic shock）
C. 敗血症分配性休克（distributive shock）
D. 心外阻塞性休克（extracardiac obstructive shock）

正確答案：C. 敗血症分配性休克（distributive shock）